Clinical trial exclusion criterion:
4. Patient has been taking regular steroid medication.

Annotated entities:
- Drug: "steroid medication"
- Multiplier: "regular"